Measurable disease.

The above is a clinical trial inclusion criterion. Annotated with entity spans:
[Condition: Measurable disease].